除了再出血外，動脈瘤破裂的病人最常出現嚴重後遺症及死亡的原因為：
A. 水腦（hydrocephalus）
B. 癲癇（seizure）
C. 血管攣縮（vasospasm)
D. 頭痛（headache）

正確答案：C. 血管攣縮（vasospasm)